Which disease do pathogenic NR2F1 variants cause?

Bosch-Boonstra-Schaaf Optic Atrophy Syndrome